9. Prior enrollment failure or randomization in this study.

The above is a clinical trial exclusion criterion. Annotated with entity spans:
9. [Non-query-able: Prior enrollment failure or randomization in this study.]